19. Active hepatitis B or C or other active liver disease

The above is a clinical trial exclusion criterion. Annotated with entity spans:
19. [Temporal: Active] [Condition: hepatitis B] or C or other [Temporal: active] [Condition: liver disease]